Clinical trial exclusion criteria:
Epilepsy
Hydrocephalus with ventricular drain
Coagulation disorders
Allergy to anesthetic agents
Severe health conditions such as cancer, failure of heart, lung, liver or kidney
Active infections

Annotated entities:
- Condition: "Epilepsy"
- Condition: "Hydrocephalus"
- Device: "ventricular drain"
- Condition: "Coagulation disorders"
- Condition: "Allergy"
- Drug: "anesthetic agents"
- Condition: "Severe health conditions"
- Undefined_semantics: "Severe health conditions"
- Subjective_judgement: "Severe health conditions"
- Condition: "cancer"
- Condition: "failure of heart"
- Condition: "failure of lung"
- Condition: "failure of liver"
- Condition: "failure of kidney"
- Condition: "infections"
- Undefined_semantics: "infections"
- Temporal: "Active"